Clinical trial exclusion criteria:
No consent
Spinal anesthesia or sciatic nerve block contraindicated
Known intolerance to tramadol or other contraindications for the drug

Annotated entities:
- Observation: "consent"
- Negation: "No"
- Informed_consent: "No consent"
- Procedure: "Spinal anesthesia"
- Procedure: "sciatic nerve block"
- Condition: "contraindicated"
- Condition: "intolerance"
- Drug: "tramadol"
- Condition: "contraindications"
- Drug: "the drug"
- Qualifier: "other"